Clinical trial inclusion criteria:
Any patient age 4-16 years with sickle cell disease who presents the Pediatric ER with acute sickle cell pain crisis with a pain of 6/10 or higher

Annotated entities:
- Person: "age"
- Value: "4-16 years"
- Condition: "sickle cell disease"
- Visit: "Pediatric ER"
- Condition: "acute sickle cell pain crisis"
- Measurement: "pain"
- Value: "6/10 or higher"